一位 40 歲男性有尿路結石病史，再次因腹痛至急診室，下列敘述何者錯誤？
A. 結石所引起的腎絞痛起初可由腰腹部開始，後擴散到腹股溝及睪丸
B. 中段輸尿管結石的腎絞痛常會痛得令病患無法靜止下來
C. 輸尿管結石接近膀胱時，常會有頻尿及尿急迫感的感覺
D. 若產生了噁心、嘔吐等症狀，即可排除腎絞痛的可能

正確答案：D. 若產生了噁心、嘔吐等症狀，即可排除腎絞痛的可能